Clinical trial inclusion criterion:
current diagnosis of narcolepsy with cataplexy OR healthy control

Annotated entities:
- Condition: "narcolepsy"
- Condition: "cataplexy"
- Condition: "healthy"